Karnofsky Performance Status (KPS) < 60.

The above is a clinical trial exclusion criterion. Annotated with entity spans:
[Measurement: Karnofsky Performance Status] ([Measurement: KPS]) [Value: < 60].